Which factors are inhibited by Abelacimab?

Abelacimab is a novel dual inhibitor of Factor XI and Factor XIa.